absence of abnormal findings on X-ray.

The above is a clinical trial inclusion criterion. Annotated with entity spans:
[Negation: absence of] [Condition: abnormal findings] on [Procedure: X-ray].